Hombre de 54 años que acude a revisión en su empresa. Se detecta un índice de masa corporal de 32,8 kg/m2 y glucemia en ayunas 138 mg/L. Un mes después, glucemia 130 mg/dL. ¿Qué recomendación terapéutica efectuaría en primer lugar?
1. Administración de metformina.
2. Prescribir una sulfonilurea.
3. Cambios conductuales: Dieta y ejercicio físico.
4. Insulina antes de cada comida.
5. Tomar acarbosa por la noche, antes de acostarse.

Respuesta correcta: 3. Cambios conductuales: Dieta y ejercicio físico.